Clinical trial exclusion criteria:
Unable to speak Spanish or English
Active smoking (within the past year)
Autoimmune, rheumatologic or inflammatory disease which are not psoriasis or psoriatic arthritis
Known active cancer receiving treatment
Pregnancy
Anemia (hemoglobin < 9 mg/dl) or thrombocytopenia (Platelet count <75), or thrombocytosis (Platelet count >600)
A history of severe bleeding or bleeding disorders
Current medication use which interact with either aspirin or atorvastatin
Chronic kidney disease (CrCl < 30ml/min)
Congestive heart failure
Currently taking aspirin or a statin.
NSAID use within the past 48 hours

Annotated entities:
- Non-query-able: "Unable to speak Spanish or English"
- Qualifier: "Active"
- Observation: "smoking"
- Value: "within the past year"
- Condition: "disease Autoimmune"
- Condition: "inflammatory disease"
- Condition: "disease rheumatologic"
- Negation: "not"
- Condition: "psoriasis"
- Condition: "psoriatic arthritis"
- Condition: "cancer"
- Qualifier: "active"
- Procedure: "treatment"
- Condition: "Pregnancy"
- Condition: "Anemia"
- Measurement: "hemoglobin"
- Value: "< 9 mg/dl"
- Condition: "thrombocytopenia"
- Measurement: "Platelet count"
- Value: "<75"
- Condition: "thrombocytosis"
- Measurement: "Platelet count"
- Value: ">600"
- Temporal: "history"
- Qualifier: "severe"
- Condition: "bleeding"
- Condition: "bleeding disorders"
- Temporal: "Current"
- Drug: "medication"
- Drug: "aspirin"
- Drug: "atorvastatin"
- Condition: "interact"
- Condition: "Chronic kidney disease"
- Measurement: "CrCl"
- Value: "< 30ml/min"
- Condition: "Congestive heart failure"
- Drug: "aspirin"
- Drug: "statin"
- Drug: "NSAID"
- Temporal: "within the past 48 hours"